Clinical trial inclusion criterion:
18-50 ages

Entity relations:
- Has_value("ages", "18-50")